2. 18 to 75 years old (inclusive)

The above is a clinical trial inclusion criterion. Annotated with entity spans:
[Parsing_Error: 2.] [Value: 18 to 75 years old (inclusive)]